下列何者不是新生兒胎便吸入症候群（meconium aspiration syndrome）之臨床表現？
A. 呼吸急促
B. 貧血
C. 氣胸
D. 膚色藍紫色

正確答案：B. 貧血